Chronic HCV Infection with Genotype 2 or 3

The above is a clinical trial exclusion criterion. Annotated with entity spans:
[Condition: Chronic HCV Infection] with [Qualifier: Genotype 2] or 3